Patients with diabetes, autoimmune diseases.

The above is a clinical trial exclusion criterion. Annotated with entity spans:
Patients with [Condition: diabetes], [Condition: autoimmune diseases].